Señale qué fármaco, de los que se relacionan, produce midriasis y cicloplejía:
1. Betanecol.
2. Timolol.
3. Tropicamida.
4. Edrofonio.
5. Pralidoxima.

Respuesta correcta: 3. Tropicamida.